Clinical trial exclusion criterion:
Have symptoms or signs suggestive of current active or latent TB upon medical history, physical examination and/or chest radiograph, or positive Mycobacterium tuberculosis antigen-specific interferon-gamma release assay (IGRA)

Entity relations:
- Has_temporal("active", "current")
- Has_qualifier("TB", "active")
- Has_value("Mycobacterium tuberculosis antigen-specific interferon-gamma release assay (IGRA)", "positive")
- AND("medical history", "TB")
- OR("active", "latent")
- OR("medical history", "physical examination", "chest radiograph")
- OR("medical history", "Mycobacterium tuberculosis antigen-specific interferon-gamma release assay (IGRA)")